history of hypersensitivity to test drugs

The above is a clinical trial exclusion criterion. Annotated with entity spans:
[Temporal: history] of [Condition: hypersensitivity] to [Drug: test drugs]